Gastroesophageal Reflux Disease (GERD; active requiring significant intervention not including OTC medication)

The above is a clinical trial exclusion criterion. Annotated with entity spans:
[Condition: Gastroesophageal Reflux Disease] ([Condition: GERD]; active requiring [Procedure: significant intervention] [Negation: not] including [Drug: OTC medication])